下列有關手部神經支配的敘述，何者錯誤？
A. 正中神經是負責手掌大拇指側感覺的主要神經
B. 尺神經負責手掌內側的感覺
C. 橈神經負責整個手背的感覺
D. 尺神經受傷，會造成第四及第五指的遠端指間關節不能屈曲

正確答案：C. 橈神經負責整個手背的感覺